Clinical trial exclusion criterion:
Preexisting systemic diseases or conditions that may confound the results of the study;

Annotated entities:
- Temporal: "Preexisting"
- Condition: "systemic diseases"
- Condition: "conditions"
- Qualifier: "may confound the results of the study"